Clinical trial inclusion criterion:
Impaired glucose regulation diagnostic criteria according to 1998 WHO diagnostic criteria.

Annotated entities:
- Condition: "Impaired glucose regulation"
- Qualifier: "1998 WHO diagnostic criteria"